Clinical trial inclusion criterion:
Radial arterial pulse may be present or absent by palpation.

Annotated entities:
- Condition: "pulse"
- Qualifier: "Radial arterial"
- Measurement: "palpation"
- Value: "absent"
- Value: "present"